Morbid obesity (BMI> 40 kg / m2).

The above is a clinical trial exclusion criterion. Annotated with entity spans:
[Condition: Morbid obesity] ([Measurement: BMI][Value: > 40 kg / m2]).